一位22歲男性有癲癇之病史，晚上參加朋友的生日派對後，當天即出現冒	、頭暈、噁心、心悸的現象，因而來急診求診。經過詢問，此症狀是他與朋友一同使用不知名藥物後才出現，病人在急診室候診時顯得相當亢奮、坐立難安。理學檢查：體溫38.2℃、呼吸26 次/min、血壓172/92 mmHg，聽心音快且不規則135次/min，雙側瞳孔放大。該病人最有可能使用何種藥物？
A. 安非他命（amphetamine）
B. 海落英（heroin）
C. 嗎啡（morphine）
D. 抗膽鹼性的藥物（anticholinergic agents）

正確答案：A. 安非他命（amphetamine）